Pregnant patients who require a scheduled or non-urgent cesarean birth

The above is a clinical trial inclusion criterion. Annotated with entity spans:
[Condition: Pregnant] patients who require a [Qualifier: scheduled] or [Qualifier: non-urgent] [Procedure: cesarean birth]